Clinical trial inclusion criterion:
Established (i.e. by clinical signs or imaging studies) coronary artery disease (CAD) Established (i.e. by clinical signs or imaging studies) peripheral vascular disease (PVD) Previous stroke Previous MI Diabetes mellitus with target organ disease OR

Entity relations:
- AND("Diabetes mellitus", "target organ disease")
- Has_temporal("MI", "Previous")
- Has_temporal("stroke", "Previous")
- Subsumes("Established", "clinical signs")
- Has_context("peripheral vascular disease (PVD)", "Established")
- Subsumes("Established", "clinical signs")
- Has_context("coronary artery disease (CAD)", "Established")
- OR("coronary artery disease (CAD)", "MI", "stroke", "peripheral vascular disease (PVD)", "Diabetes mellitus")
- OR("clinical signs", "imaging studies")
- OR("clinical signs", "imaging studies")